Clinical trial exclusion criterion:
Severely elevated serum BNP defined as BNP>300pg/ml

Annotated entities:
- Value: "Severely elevated"
- Measurement: "serum BNP"
- Measurement: "BNP"
- Value: ">300pg/ml"